下列何者為穿過海綿竇（cavernous sinus）之感覺神經？
A. 副神經
B. 第八顱神經
C. 第四顱神經
D. 眼神經（ophthalmic nerve）

正確答案：D. 眼神經（ophthalmic nerve）